What is the contribution of ultraconserved elements in Australasian smurf-weevils?

Ultraconserved elements (UCEs) resolve the phylogeny of Australasian smurf-weevils.